Clinical trial inclusion criterion:
Expected survival period= 6 months

Annotated entities:
- Observation: "Expected survival period"
- Value: "= 6 month"